強力膠因含有那種物質導致常被吸食濫用？
A. 甲苯
B. 乙醚
C. 甲醇
D. 甲醛

正確答案：A. 甲苯